支配陰囊後半部的神經為下列何者的分枝？
A. 股神經
B. 陰部神經
C. 生殖股神經
D. 髂腹股溝神經

正確答案：B. 陰部神經